COPD exacerbation, very severe COPD with hypoxemia at low altitude (FEV1/FVC <0.7, FEV1 <40% predicted, oxygen saturation on room air <92% at 750 m).

The above is a clinical trial exclusion criterion. Annotated with entity spans:
[Condition: COPD exacerbation], [Qualifier: very severe] [Condition: COPD] with [Condition: hypoxemia] at [Qualifier: low altitude] ([Measurement: FEV1/FVC] [Value: <0.7], [Measurement: FEV1] [Value: <40% predicted], [Measurement: oxygen saturation] on [Qualifier: room air] [Value: <92%] at [Qualifier: 750 m]).